Es una característica de la piruvato quinasa:
1. Catalizar una reacción reversible.
2. Catalizar una reacción que da lugar a un producto con un solo grupo fosfato.
3. Catalizar una reacción que genera ATP.
4. Participar en la gluconeogénesis.

Respuesta correcta: 3. Catalizar una reacción que genera ATP.